Clinical trial inclusion criterion:
2. Histologic documentation of the original primary tumor.

Annotated entities:
- Parsing_Error: "2."
- Procedure: "Histologic"
- Condition: "original primary tumor"
- Value: "documentation"